Clinical trial inclusion criteria:
Non-ventilated Patients over the age of 65

Annotated entities:
- Person: "age"
- Value: "over 65"
- Procedure: "ventilated"
- Negation: "Non"